何種頭痛特別好發於男性？
A. 預兆偏頭痛（migraine with aura）
B. 無預兆偏頭痛（migraine without aura）
C. 緊縮型頭痛（tension-type headache）
D. 叢發性頭痛（cluster headache）

正確答案：D. 叢發性頭痛（cluster headache）